Clinical trial inclusion criterion:
age over 40

Entity relations:
- Has_value("age", "over 40")